Allergy or previous adverse reaction to prazosin or other alpha-1 antagonist

The above is a clinical trial exclusion criterion. Annotated with entity spans:
[Condition: Allergy] or [Temporal: previous] [Condition: adverse reaction] to [Drug: prazosin] or [Qualifier: other] [Drug: alpha-1 antagonist]